Puede producir importantes intoxicaciones alimentarias:
1. Lenconostoc mesenteroides.
2. Helicobacter pylori.
3. Coxiella burnetti.
4. Staphylococcus aureus.

Respuesta correcta: 4. Staphylococcus aureus.